Has undergone first time isolated CABG due to an episode of acute coronary syndrome (STEMI, NSTEMI, unstable angina) within 6 weeks before surgery

The above is a clinical trial inclusion criterion. Annotated with entity spans:
Has undergone [Multiplier: first time] [Procedure: isolated CABG] due to an episode of [Condition: acute coronary syndrome] ([Condition: STEMI], [Condition: NSTEMI], [Condition: unstable angina]) [Temporal: within 6 weeks before surgery]